natalizumab,

The above is a clinical trial inclusion criterion. Annotated with entity spans:
[Drug: natalizumab],